Risk of severe alcohol withdrawal (e.g. history of seizures or delirium tremens)

The above is a clinical trial exclusion criterion. Annotated with entity spans:
[Mood: Risk of] [Qualifier: severe] [Condition: alcohol withdrawal] (e.g. [Temporal: history] of [Condition: seizures] or [Condition: delirium tremens])